關於純母乳哺育之嬰幼兒的衛教指導，下列敘述何者最正確？
A. 鼓勵純母乳哺育至嬰兒12個月大
B. 純母乳哺餵之嬰兒維生素K可能不足，6個月後須額外補充
C. 純母乳哺育的嬰兒，在出生後6個月內無需補充氟
D. 早產兒純母乳哺餵時鐵質可能不足，須額外補充；足月兒則會足夠，無需額外補充

正確答案：C. 純母乳哺育的嬰兒，在出生後6個月內無需補充氟